Clinical trial exclusion criterion:
Planned postoperative TSH goal other than 0.1-0.5 mU/L

Annotated entities:
- Measurement: "TSH"
- Qualifier: "postoperative"
- Value: "0.1-0.5 mU/L"
- Negation: "other than"